cardiovascular disease

The above is a clinical trial exclusion criterion. Annotated with entity spans:
[Condition: cardiovascular disease]